Clinical trial inclusion criterion:
Willing to comply with all study procedures and be available for the duration of the study.

Annotated entities:
- Post-eligibility: "Willing to comply with all study procedures and be available for the duration of the study."